Multiple contiguous gingival recession defects on a minimum of two adjacent teeth, exhibiting 3mm or more recession on at least one of those teeth

The above is a clinical trial inclusion criterion. Annotated with entity spans:
[Multiplier: Multiple] contiguous [Condition: gingival recession defects] on a [Multiplier: minimum of two] adjacent teeth, exhibiting [Value: 3mm or more] [Measurement: recession] on [Multiplier: at least one] of those teeth